Presence of sustained ventricular tachycardia with HR> 120 bpm

The above is a clinical trial inclusion criterion. Annotated with entity spans:
Presence of [Qualifier: sustained] [Condition: ventricular tachycardia] with [Measurement: HR][Value: > 120 bpm]